10 歲大的女孩，診斷為急性白血病的同時被檢查出有t(15,17)之染色體轉位。下列何者是最可能的診斷？
A. AML M7 type
B. early pre-B ALL
C. AML M3 type
D. mature B-cell ALL

正確答案：C. AML M3 type